一位 21 歲的男性患者，最近半年來偶而在半夜或清晨會有腰酸背痛發生。最近二個月來，幾乎每天清晨會有腰酸、腰部僵硬及起床困難。此外，胸口悶痛及左側大腿關節及左膝關節會有運動性疼痛。白天工作時則上述症狀會緩解。但是坐太久則會有腰酸背痛而坐立不安。經抽血檢查發現 ESR 43 mm/1h，88 mm/2h，CRP 3.76 mg/dL，ANA 1：160（＋）speckled，IgG 1650 mg/dL， mg/dL，IgM 124 mg/dL，RF＜20 IU/mL。這位患者最有可能的診斷是：
A. rheumatoid arthritis
B. systemic lupus erythematosus
C. left side sciatica
D. ankylosing spondylitis

正確答案：D. ankylosing spondylitis